下列有關咳嗽之敘述，何者錯誤？
A. 在正常情況下，咳嗽可用來做清理呼吸道的保護機制
B. 有些藥物，如ACEI（angiotensin-converting enzyme inhibitor）亦會引起咳嗽
C. 胃食道逆流會引起食道發炎，但不會引發慢性咳嗽
D. 咳嗽可因外在因子（如煙、塵）或內在因子（如呼吸道分泌物）誘發

正確答案：C. 胃食道逆流會引起食道發炎，但不會引發慢性咳嗽